List MHC-I-associated inflammatory disorders.

ankylosing spondylitis
birdshot chorioretinopathy
Behçet's disease 
psoriasis